Clinical trial exclusion criterion:
Untreated severe comorbid psychiatric or somatic illness.

Entity relations:
- Has_qualifier("somatic illness", "Untreated")
- AND("Untreated", "severe")
- AND("severe", "comorbid")
- OR("somatic illness", "illness psychiatric")